20 = Age < 80 years

The above is a clinical trial inclusion criterion. Annotated with entity spans:
[Value: 20 =] [Person: Age] [Value: < 80 years]